Clinical trial inclusion criterion:
Absolute neutrophil count >= 1.5 x 109/L, Hemoglobin >= 9g/dL, Platelets>=100 x 109/L Bilirubin <= 1.5 x upper limit of normal AST/ALT <= 2.5 X upper limit of normal(5.0 x upper limit of normal, for subject with liver metastases) Creatinine<= 1.5 X UNL

Entity relations:
- Has_value("Absolute neutrophil count", ">= 1.5 x 109/L")
- Has_value("Hemoglobin", ">= 9g/dL,")
- Has_value("Platelets", ">=100 x 109/L")
- Has_value("Bilirubin", "<= 1.5 x upper limit of normal")
- Has_value("AST", "<= 2.5 X upper limit of normal(")
- Has_value("ALT", "<= 2.5 X upper limit of normal(")
- AND("liver metastases", "AST")
- AND("liver metastases", "ALT")
- Has_value("AST", "5.0 x upper limit of normal")
- Has_value("ALT", "5.0 x upper limit of normal")
- Has_value("Creatinine", "<= 1.5 X UNL")